Seeking treatment for Alcohol Use Disorder

The above is a clinical trial inclusion criterion. Annotated with entity spans:
[Mood: Seeking] [Procedure: treatment] for [Condition: Alcohol Use Disorder]